Clinical trial inclusion criterion:
Yale-Brown Obsessive-Compulsive Scale (Y-BOCS) score of = 16

Annotated entities:
- Measurement: "Yale-Brown Obsessive-Compulsive Scale"
- Measurement: "Y-BOCS"
- Value: "score of = 16"